Child-Pugh grade in A-level;

The above is a clinical trial inclusion criterion. Annotated with entity spans:
[Measurement: Child-Pugh grade] in [Value: A]-level;